Clinical trial exclusion criterion:
Multiple pregnancy

Annotated entities:
- Condition: "Multiple pregnancy"